¿Cuál de las siguientes aseveraciones sobre el meta-análisis es correcta?
1. El objetivo del meta-análisis es resumir cuantitativamente los resultados de los estudios realizados.
2. El meta-análisis es un ensayo clínico de grandes proporciones.
3. Sería deseable evitar los ensayos clínicos negativos, así como los no publicados, para impedir sesgos de selección.
4. Por definición, todos los meta-análisis son una fuente fidedigna de evidencia, siendo irrelevante la calidad de los ensayos o si incluyen los resultados de ensayos clínicos aleatorizados.
5. El meta-análisis subsanará los errores de realización de los ensayos.

Respuesta correcta: 1. El objetivo del meta-análisis es resumir cuantitativamente los resultados de los estudios realizados.